Angelman syndrome is associated with deletion of a part of Chromosome 15 but if the deletion occurs in the paternally inherited chromosome 15, what is the disease?

prader-willi syndrome (pws) results from a deletion of the paternal genes in the region of chromosome 15q11-q13.